65 歲男性，正接受化學治療之大腸癌患者，因發燒、黃痰、呼吸喘促而到醫院就診。理學檢查顯示：意識昏迷、血壓 80/60 mmHg、心跳 150 次/min、呼吸淺快 30 次/min、有喘鳴聲與吸氣囉音、嘴唇與四肢發紺。未使用氧氣下之動脈血氣體分析數據如下：pH 7.25、PaCO2 67 mmHg、PaO2 45 mmHg 。下列何者為最不適切的治療？
A. 給予鼻管氧氣
B. 靜脈輸液
C. 氣管插管
D. 廣效性抗微生物製劑

正確答案：A. 給予鼻管氧氣